下列的何種發現對診斷ankylosing spondylitis最有幫助？
A. positive HLA-B27
B. history of low back pain in old patients
C. pain on motion during chest expansion
D. symmetric sacroiliitis in X-ray films

正確答案：D. symmetric sacroiliitis in X-ray films